Clinical trial inclusion criterion:
Patients presenting for elective posterior spinal fusion surgery (lower thoracic, lumbar, sacral)

Entity relations:
- Has_qualifier("posterior spinal fusion surgery", "elective")
- Has_qualifier("posterior spinal fusion surgery", "lower thoracic")
- OR("lower thoracic", "lumbar", "sacral")